Which are the major intramolecular phosphorylation sites of human Chk2 involved in cell cycle control?

The major phosphorylation sites of human Chk2 involved in cell cycle control are T68, S19, and S33/35.